Clinical trial inclusion criterion:
critical limb ischemia (Rutherford class 4-6)

Annotated entities:
- Condition: "limb ischemia"
- Measurement: "Rutherford class"
- Value: "4-6"
- Qualifier: "critical"